Clinical trial inclusion criterion:
Living in the area throughout the duration of the study

Entity relations:
- multi("throughout the duration of the study", "the study")
- Has_temporal("Living in the area", "throughout the duration of the study")